Clinical trial inclusion criteria:
American Society of Anesthesiologist (ASA) status I-II adult patients undergoing elective laparoscopic cholecystectomy.

Annotated entities:
- Measurement: "American Society of Anesthesiologist (ASA)"
- Value: "status I-II"
- Person: "adult"
- Qualifier: "elective"
- Procedure: "laparoscopic cholecystectomy"